Clinical trial exclusion criterion:
Inability to provide written informed consent according to the Yale Human Investigation Committee (HIC) guidelines in English.

Annotated entities:
- Negation: "Inability to provide"
- Observation: "written informed consent"
- Qualifier: "Yale Human Investigation Committee (HIC) guidelines"
- Qualifier: "in English"